Clinical trial inclusion criterion:
Low back pain of less than six weeks' duration; and at least moderate pain intensity (NRS<U+2267>4)

Entity relations:
- Has_temporal("Low back pain", "less than six weeks' duration")
- Has_value("NRS", "4")
- Has_value("pain intensity", "at least moderate")
- Subsumes("pain intensity", "NRS")